針對先天性脊柱側彎（congenital scoliosis）的成因分類中，下列何者彎曲度變大的速度最快、預後最差？
A. 全分離型半脊椎畸形（free hemivertebra）
B. 嵌入型半脊椎畸形（incarcerated hemivertebra）
C. 單側未分段脊節（unilateral unsegmented bar）
D. 單側未分段脊節加上對側半脊椎畸形（unilateral and unsegmented bar with contralateral hemivertebra）

正確答案：D. 單側未分段脊節加上對側半脊椎畸形（unilateral and unsegmented bar with contralateral hemivertebra）